Clinical trial exclusion criterion:
Current unstable angina.

Entity relations:
- Has_temporal("unstable angina", "Current")